Clinical trial inclusion criterion:
5. Multivessel disease with at least one significant stenosis in LAD and with treatment of the lesion in another major epicardial coronary artery. A two-vessel disease or a three-vessel disease may be viewed as a combination of a side branch and a main epicardial vessel provided they supply different territories; left anterior descending, left circumflex and right coronary artery);

Entity relations:
- AND("at least one", "significant stenosis in LAD")
- Has_qualifier("treatment of the lesion", "in another major epicardial coronary artery")